一位病人之血清生化學檢查結果如下：bilirubin（T/D）= 4.5/2.5 mg/dL；A/G = 2.8/3.5 gm/dL；alkaline phosphatase = 278 U/L（正常< 238 U/L）；GOT = 105 U/L（正常< 31 U/L）；GPT = 85 U/L（正常< 31  U/L）；另外 prothrombin time = 17.5/11.5 sec.，其最可能之診斷：
A. 肝硬化併有肝功能失償（decompensated liver cirrhosis）
B. 肝細胞癌（hepatocellular carcinoma）
C. 膽管細胞癌（cholangiocarcinoma）
D. 總膽管結石

正確答案：A. 肝硬化併有肝功能失償（decompensated liver cirrhosis）